Clinical trial exclusion criterion:
Patients who have undergone a previous solid organ transplant (including kidney transplant) or who are going to receive another solid organ transplant concomitantly.

Annotated entities:
- Procedure: "solid organ transplant"
- Temporal: "previous"
- Procedure: "kidney transplant"
- Qualifier: "another"
- Procedure: "solid organ transplant"
- Temporal: "concomitantly"